3. Uncontrolled inter-current illness

The above is a clinical trial exclusion criterion. Annotated with entity spans:
[Parsing_Error: 3.] [Undefined_semantics: Uncontrolled inter-current illness]